Candidate for Gastric By-Pass

The above is a clinical trial inclusion criterion. Annotated with entity spans:
[Mood: Candidate] for [Procedure: Gastric By-Pass]